Clinical trial exclusion criterion:
9. Intention to treat more than 1 totally occluded major epicardial vessel;

Annotated entities:
- Mood: "Intention to"
- Multiplier: "more than 1"
- Qualifier: "totally occluded major epicardial vessel"
- Procedure: "treat"